下列何者不是由α-subunit與β-subunit組合而成的激素？
A. GnRH（gonadotropin releasing hormone）
B. TSH（thyroid stimulating hormone）
C. FSH（follicle stimulating hormone）
D. LH（luteinizing hormone）

正確答案：A. GnRH（gonadotropin releasing hormone）